Clinical trial inclusion criterion:
Measurable metastatic disease as defined by Response Evaluation Criteria in Solid Tumors (RECIST)

Annotated entities:
- Measurement: "Response Evaluation Criteria in Solid Tumors (RECIST)"
- Condition: "metastatic disease"